Clinical trial exclusion criterion:
Subjects were not to have donated blood within 90 days prior to study initiation.

Entity relations:
- Has_index("within 90 days prior to study initiation", "study initiation")
- Has_temporal("donated blood", "within 90 days prior to study initiation")
- Has_negation("donated blood", "not")